下列敘述，何者錯誤？
A. 胃惡性腫瘤的根治性切除手術是使用預防性抗生素的適應症
B. 清潔污染傷口（clean-contaminated wound）的手術是指在控制情形下，手術過程進入呼吸道、消化道、生殖道或泌尿道且無不尋常之污染
C. 正確使用預防性抗生素就不必注意皮膚的消毒
D. 沒有明顯細菌污染或植入物之低風險清潔傷口（clean wound）手術，可以不必使用預防性抗生素

正確答案：C. 正確使用預防性抗生素就不必注意皮膚的消毒